En una interacción comunicativa dirigida a la evaluación psicológica podemos decir, como criterio general, que el cómputo final de palabras del evaluador debe ser:
1. Inferior a las del evaluado.
2. Igual que las del evaluado.
3. Superior a las del evaluado.
4. El máximo posible.

Respuesta correcta: 1. Inferior a las del evaluado.